下列有關體外震波碎石術（extracorporeal shock wave lithotripsy）的敘述，何者正確？
A. 利用心電圖 P 波啟動，以減少心律不整之發生
B. 震波可造成結石崩解，對組織之傷害極小，因此其震波數不必限制
C. 治療中之效果可以很準確地利用 X 光機來評估
D. 處理兩側較大尿路結石，應積極地放置雙鉤導管再輔以碎石術，以防止兩側同時發生尿流阻塞

正確答案：D. 處理兩側較大尿路結石，應積極地放置雙鉤導管再輔以碎石術，以防止兩側同時發生尿流阻塞